Clinical trial inclusion criterion:
Colonoscopy

Annotated entities:
- Procedure: "Colonoscopy"